Clinical trial inclusion criterion:
Lower back pain and/or sciatica with or without spinal claudication.

Entity relations:
- AND("Lower back pain", "spinal claudication")
- OR("Lower back pain", "sciatica")